高血壓病患比較容易罹患姿勢性低血壓（postural hypotension），其原因為何？
A. 感壓反射（baroreflex）的敏感度（sensitivity）增加
B. 感壓反射的敏感度降低
C. 心房牽張反射的代償能力增加
D. 心房牽張反射的代償能力降低

正確答案：B. 感壓反射的敏感度降低